單一心室合併肺動脈狹窄（Single ventricle with pulmonary stenosis）之8個月大病童，在病房發現其活力不 佳，且有嚴重發紺現象。身體診察發現心跳速率每分鐘40下，血氧濃度40%。下列何種處置不恰當？
A. 將病患維持Knee-chest position，並給與氧氣
B. 如有嚴重酸中毒，給與Bicarbonate治療
C. 給與Epinephrine急救治療
D. 會診小兒心臟外科醫師評估手術治療介入時機

正確答案：C. 給與Epinephrine急救治療